一位 10 歲男童 近發生上呼吸道感染並在心肌中出現 Aschoff bodies。下列有關此心肌病變的敘述中，何者 不適當？
A. 類纖維蛋白壞死併膨脹嗜伊紅性的膠原
B. 出現 Anitschkow 細胞（毛毛蟲樣細胞）
C. 多核巨細胞形成 Aschoff 巨細胞
D. 只發生於心肌

正確答案：D. 只發生於心肌